No administration of diuretics and BCAA within the past 1 week

The above is a clinical trial inclusion criterion. Annotated with entity spans:
[Negation: No] administration of [Drug: diuretics] and [Drug: BCAA] within the [Temporal: past 1 week]